Clinical trial inclusion criterion:
Spinal pain as measured by BASDAI question #2 = 4 cm (0-10 cm) at baseline

Annotated entities:
- Condition: "Spinal pain"
- Measurement: "BASDAI question #2"
- Value: "= 4 cm"
- Temporal: "at baseline"